Positive HIV in the screening examination of history of any immunosuppressant disease;

The above is a clinical trial exclusion criterion. Annotated with entity spans:
[Value: Positive] [Measurement: HIV] [Temporal: in the screening examination] of history of any [Condition: immunosuppressant disease];